戒菸門診中有一位40歲男性病人想要在一個月之內採取戒菸行動，是屬於跨越理論模式（transtheoretical model）中之那一期？
A. 未考慮階段（precontemplation）
B. 考慮階段（preparation）
C. 沈思階段（contemplation）
D. 行動階段（action）

正確答案：B. 考慮階段（preparation）